下列何者不是二尖瓣狹窄的身體檢查所見：
A. S1 accentuation
B. pre-systolic murmur
C. systolic murmur
D. opening snap

正確答案：C. systolic murmur